下列何者最不可能由右冠狀動脈供應？
A. 右心房
B. 房室結
C. 節制帶（moderator band）
D. 房室束

正確答案：D. 房室束